Clinical trial exclusion criterion:
Subject with a history of prostatectomy because of prostate cancer, including nerve sparing techniques. Subjects with a history of surgical procedures for the treatment of benign prostate hypertrophy are permitted, with the exception of cryosurgery, cryotherapy or cryoablation

Annotated entities:
- Procedure: "prostatectomy"
- Condition: "prostate cancer"
- Procedure: "nerve sparing techniques"
- Procedure: "surgical procedures"
- Condition: "benign prostate hypertrophy"
- Negation: "permitted"
- Procedure: "cryosurgery"
- Procedure: "cryotherapy"
- Procedure: "cryoablation"
- Temporal: "history of"
- Negation: "with the exception of"